Clinical trial inclusion criterion:
Treated hypertensive patients with an average daytime ambulatory blood pressure measurement (ABPM) <150/95mmHg on stable doses of one or more antihypertensive medication (at least one of which should be; an ACE inhibitor, angiotensin receptor blocker or diuretic) for 3 months, or untreated hypertensive patients with an average daytime ABPM =135/85 but <150/95.

Annotated entities:
- Condition: "hypertensive"
- Qualifier: "Treated"
- Measurement: "average daytime ambulatory blood pressure measurement (ABPM)"
- Value: "<150/95mmHg"
- Qualifier: "stable doses"
- Drug: "antihypertensive medication"
- Multiplier: "one or more"
- Drug: "ACE inhibitor"
- Drug: "angiotensin receptor blocker"
- Drug: "diuretic"
- Multiplier: "at least one"
- Temporal: "for 3 months"
- Qualifier: "untreated"
- Condition: "hypertensive patients"
- Measurement: "average daytime ABPM"
- Value: "=135/85 but <150/95"